Clinical trial exclusion criterion:
Operations in the past 6 months which could limit the erectile function

Annotated entities:
- Temporal: "in the past 6 months"
- Procedure: "Operations"
- Condition: "limit the erectile function"